Clinical trial exclusion criterion:
Severe Hypertension Grade 3 WHO classification (Mean Sitting Diastolic Blood Pressure (MSDBP) 110 mmHg and/or Mean Sitting Systolic Blood Pressure MSSBP 180 mmHg)

Entity relations:
- Has_value("Grade WHO classification", "3")
- Has_value("Mean Sitting Diastolic Blood Pressure (MSDBP)", "110 mmHg")
- Has_value("Mean Sitting Systolic Blood Pressure MSSBP", "180 mmHg")
- AND("Severe Hypertension", "Grade WHO classification")
- Subsumes("3", "Mean Sitting Diastolic Blood Pressure (MSDBP)")
- OR("Mean Sitting Diastolic Blood Pressure (MSDBP)", "Mean Sitting Systolic Blood Pressure MSSBP")